Señala cuál de estas enzimas cataliza una reacción de fosforilación a nivel de sustrato en la glucolisis:
1. Fosfofructoquinasa.
2. Fosfoglicerato quinasa.
3. Gliceraldehído-3-fosfato deshidrogenasa.
4. Hexoquinasa.

Respuesta correcta: 2. Fosfoglicerato quinasa.